正常之心包膜腔有多少心包膜液？
A. < 5 c.c.
B. 5-30 c.c.
C. 30-70 c.c.
D. 70-120 c.c.

正確答案：B. 5-30 c.c.